Clinical trial exclusion criterion:
Medical condition requiring chronic use of high dose systemic corticosteroids (i.e., doses of prednisone higher than 10 mg/day or equivalent). Brief (<15 days) treatment with glucocorticoids (prednisone 100 mg by mouth daily, or equivalent) is acceptable.

Entity relations:
- Has_multiplier("systemic corticosteroids", "high dose")
- Has_multiplier("prednisone", "higher than 10 mg/day")
- Has_temporal("systemic corticosteroids", "chronic")
- AND("Medical condition", "systemic corticosteroids")
- Subsumes("high dose", "prednisone")
- Has_multiplier("prednisone", "100 mg daily")
- Has_temporal("glucocorticoids", "<15 days")
- Subsumes("glucocorticoids", "prednisone")